Clinical trial exclusion criterion:
severe respiratory disease;

Entity relations:
- Has_qualifier("respiratory disease", "severe")